人體之正常抗胃酸逆流機制包括下列何者？
A. 下食道括約肌，橫膈膜肌肉及胃食道接合處位於橫膈膜裂孔（hiatus）之上
B. 下食道括約肌，胃底部肌肉及胃食道接合處位於橫膈膜裂孔之下
C. 下食道括約肌，胃底部肌肉及胃食道接合處位於橫膈膜裂孔之上
D. 下食道括約肌，橫膈膜肌肉及胃食道接合處位於橫膈膜裂孔之下

正確答案：D. 下食道括約肌，橫膈膜肌肉及胃食道接合處位於橫膈膜裂孔之下